Clinical trial inclusion criterion:
2. Left ventricular ejection fraction (LVEF) ≤ 40% (ECHO);

Annotated entities:
- Measurement: "Left ventricular ejection fraction (LVEF)"
- Value: "≤ 40%"
- Procedure: "ECHO"